1. Prior Therapy Exposure to chemotherapy or radiotherapy within 2 weeks prior to entering the study or those who have not recovered from adverse events due to agents administered more than 2 weeks earlier. Systemic steroids that have not been stabilized (≥ 5 days) to the equivalent of ≤10 mg/day prednisone prior to the start of the study drugs. No other investigational agents are allowed.

The above is a clinical trial exclusion criterion. Annotated with entity spans:
[Parsing_Error: 1.] [Temporal: Prior] Therapy Exposure to [Procedure: chemotherapy] or [Procedure: radiotherapy] [Temporal: within 2 weeks prior] to [Reference_point: entering the study] or those who have [Negation: not] [Condition: recovered] from [Condition: adverse events] [c-Requires_causality: due to] [Drug: agents] administered [Temporal: more than 2 weeks earlier]. [Drug: Systemic steroids] that have [Negation: not] been [Qualifier: stabilized] ([Temporal: ≥ 5 days]) to the equivalent of [Multiplier: ≤10 mg/day] [Drug: prednisone] [Temporal: prior to] the [Reference_point: start of the study drugs]. [Grammar_Error: No other investigational agents are allowed].